Clinical trial exclusion criterion:
Presence of tachycardia with irregular or supraventricular RR

Entity relations:
- OR("irregular RR", "supraventricular RR")